Coronary artery disease

The above is a clinical trial exclusion criterion. Annotated with entity spans:
[Condition: Coronary artery disease]